Clinical trial exclusion criterion:
History of severe allergy to Iodine contrast agents

Annotated entities:
- Condition: "allergy"
- Procedure: "Iodine contrast agents"